El primosoma:
1. También se denomina primasa o proteína Dna G.
2. Es el complejo responsable de la síntesis de los fragmentos de Okazaki.
3. Es una ADN ligasa bacteriana.
4. Se localiza en la mitocondria.
5. Es una unidad funcional del complejo de replicación bacteriano.

Respuesta correcta: 5. Es una unidad funcional del complejo de replicación bacteriano.